Clinical trial exclusion criterion:
Uncontrolled or active depression or other psychiatric disorder that in the opinion of the site investigator might preclude adherence to study requirements or impact NC functioning and assessments.

Entity relations:
- Has_qualifier("psychiatric disorder", "other")
- Has_qualifier("depression", "Uncontrolled")
- OR("Uncontrolled", "active")
- OR("depression", "psychiatric disorder")